Clinical trial inclusion criterion:
Written informed consent obtained from the parent or guardian of the subject.

Annotated entities:
- Observation: "Written informed consent"
- Qualifier: "parent"
- Qualifier: "guardian"